Clinical trial inclusion criterion:
Gastrectomy (subtotal or total)

Annotated entities:
- Procedure: "Gastrectomy"
- Qualifier: "subtotal"
- Qualifier: "total"